High-dose statin load <24 hours prior to procedure

The above is a clinical trial exclusion criterion. Annotated with entity spans:
[Drug: High-dose statin] load [Temporal: <24 hours prior to procedure]